Primidone 為下列那一種抗癲癎藥物的衍生物，其抗癲癎的效力與其相似？
A. phenytoin
B. phenobarbital
C. felbamate
D. topiramate

正確答案：B. phenobarbital